Respecto a la definición de la enfermedad renal crónica, una es INCORRECTA:
1. Requiere presencia persistente de alteraciones estructurales o funcionales del riñón durante al menos 2 meses.
2. Incluye alteraciones en orina como proteinuria, independientemente de la tasa de filtración glomerular (TFG).
3. Incluye una TFG menor 60 ml/min/1,73m2 de superficie corporal independientemente de la presencia o no de otros marcadores de daño renal.
4. Se clasifica en 5 estadios según la TFG.
5. La preparación para la terapia renal sustitutiva se debe hacer en estadio 4.

Respuesta correcta: 1. Requiere presencia persistente de alteraciones estructurales o funcionales del riñón durante al menos 2 meses.